Have experienced at least 2 moderate or severe COPD exacerbations leading to medical consultation (requiring oral corticosteroids or increasing dosage of oral corticosteroids and/or antibiotics or hospitalization) within the 12 months preceding Visit 1.

The above is a clinical trial inclusion criterion. Annotated with entity spans:
Have experienced [Multiplier: at least 2] [Qualifier: moderate] or [Qualifier: severe] [Condition: COPD exacerbations] leading to medical consultation (requiring [Drug: oral corticosteroids] or [Qualifier: increasing dosage] of [Drug: oral corticosteroids] and/or [Drug: antibiotics] or [Visit: hospitalization]) [Temporal: within the 12 months preceding Visit 1].